下列有關蛋白質的純化步驟，其先後次序為何？   ①發展一套該蛋白質之檢測法 ②層析法 ③純度鑑定 ④該蛋白質之萃取與定量
A. ①④②③
B. ④①②③
C. ④②③①
D. ④②①③

正確答案：A. ①④②③